Clinical trial inclusion criterion:
Hematologic ANC > 1000/uL and platelet > 75,000/uL,

Entity relations:
- Has_value("Hematologic ANC", "> 1000/uL")
- Has_value("platelet", "> 75,000/uL")